Clinical trial inclusion criterion:
Patients older than 18 years

Entity relations:
- Has_value("years", "older than 18")